Clinical trial exclusion criterion:
Fibro vascular proliferation lesions on the conjunctival and/or corneal surface (i.e.: pterygium)

Annotated entities:
- Condition: "Fibro vascular proliferation lesions"
- Qualifier: "corneal surface"
- Qualifier: "conjunctival"
- Qualifier: "pterygium"